Clinical trial exclusion criterion:
Aged under 18,

Annotated entities:
- Person: "Aged"
- Value: "under 18"